What is metaSPAdes?

MetaSPAdes is a new versatile metagenomic assembler.